下列何者與新小腦（neocerebellum, pontocerebellum）皮質無直接聯繫？
A. 橋腦核（pontine nucleus）
B. 小腦齒狀核（dentate nucleus）
C. 下橄欖核（inferior olivary nucleus）
D. 前庭神經核（vestibular nucleus）

正確答案：D. 前庭神經核（vestibular nucleus）